Previous participation in other clinical trial within 30 days of this study start;

The above is a clinical trial exclusion criterion. Annotated with entity spans:
[Non-query-able: Previous participation in other clinical trial within 30 days of this study start;]